下列何種癌症基因與「侵犯型」膀胱癌較無關連？
A. p16
B. p21
C. p53
D. Rb gene

正確答案：A. p16